Clinical trial inclusion criteria:
Persistent primary or recurrent trans-sphincteric anal fistula

Annotated entities:
- Condition: "trans-sphincteric anal fistula"
- Multiplier: "recurrent"
- Multiplier: "primary"